Which sports have a risk for commotio cordis?

Participation in sports such as baseball, football, soccer, cricket, hockey and lacrosse has a risk for commotio cordis.